Clinical trial exclusion criterion:
Is a transplant recipient (except for corneal transplant).

Annotated entities:
- Person: "transplant recipient"
- Negation: "except"
- Condition: "corneal transplant"